Clinical trial exclusion criterion:
Chronic alcohol taker

Entity relations:
- Has_qualifier("alcohol taker", "Chronic")